17. Concomitant administration of any drug that could affect bleeding (e.g., aspirin, clopidogrel, ticlopidine, warfarin, heparin, low-molecular weight heparin)

The above is a clinical trial exclusion criterion. Annotated with entity spans:
[Parsing_Error: 17.] Concomitant administration of any [Drug: drug that could affect bleeding] (e.g., [Drug: aspirin], [Drug: clopidogrel], [Drug: ticlopidine], [Drug: warfarin], [Drug: heparin], [Drug: low-molecular weight heparin])